下列有關腎細胞癌（renal cell carcinoma）CT 影像之敘述，何者錯誤？
A. 多屬高血管性腫瘤
B. 常見腫瘤壞死、出血及腎盞（calyces）破壞
C. 可呈現腎靜脈被腫瘤栓塞（thrombosis）
D. 腫瘤內有極低密度脂肪

正確答案：D. 腫瘤內有極低密度脂肪